Alpha-1 antitrypsin deficiency

The above is a clinical trial exclusion criterion. Annotated with entity spans:
[Condition: Alpha-1 antitrypsin deficiency]